Clinical trial inclusion criterion:
Body mass index (BMI) = 27 Kg/m2 and/or waist circumference = 102 cm (40 inches) in men and 88 cm (35 inches) in women, respectively.

Entity relations:
- Subsumes("= 102 cm", "40 inches")
- Subsumes("88 cm", "35 inches")
- Has_value("women", "88 cm")
- Has_value("men", "= 102 cm")
- AND("waist circumference", "men")
- Has_value("Body mass index (BMI)", "= 27 Kg/m2")
- OR("men", "women")
- OR("Body mass index (BMI)", "waist circumference")